Clinical trial exclusion criterion:
Known carrier or infection for HIV/Hep B or C. HCV ab+ must be PCR-. HBV ab+ must be HBsAg- or undetectable DNA

Annotated entities:
- Condition: "infection for HIV"
- Condition: "Hep B infection for"
- Condition: "Hep C infection for"
- Condition: "HCV ab+"
- Qualifier: "PCR-"
- Condition: "HBV ab+"
- Qualifier: "HBsAg-"
- Condition: "undetectable DNA"